Clinical trial exclusion criterion:
Chronic usage of steroids or other immunosuppressant medication.

Annotated entities:
- Drug: "steroids"
- Multiplier: "Chronic usage"
- Drug: "immunosuppressant medication"
- Undefined_semantics: "immunosuppressant medication"